Clinical trial inclusion criterion:
Minimum of 2 mm of keratinized gingiva

Entity relations:
- Has_value("keratinized gingiva", "Minimum of 2 mm")